下列有關肌肉顫動（fasciculation）之敘述，何者錯誤？
A. 肌纖維收縮出自於同一個運動單元（motor unit）
B. 生理性肌肉顫動可因緊張或劇烈運動發生
C. 病理性肌肉顫動常發生於運動神經元病變（motor neuron disorder）
D. 肌肉顫動需靠針肌電圖（needle EMG）檢查作診斷

正確答案：D. 肌肉顫動需靠針肌電圖（needle EMG）檢查作診斷